Clinical trial exclusion criterion:
4. Pregnant women

Annotated entities:
- Parsing_Error: "4."
- Person: "women"
- Condition: "Pregnant"